Clinical trial exclusion criterion:
Pulseless extremity

Annotated entities:
- Condition: "Pulseless extremity"